Clinical trial exclusion criterion:
Allergy to hyaluronic acid

Annotated entities:
- Condition: "Allergy"
- Drug: "hyaluronic acid"